Clinical trial exclusion criterion:
Previous history of receiving the rabies vaccine.

Entity relations:
- Has_temporal("rabies vaccine", "Previous history")